Clinical trial exclusion criterion:
Subject with a history of loss of vision because of non-arteritic anterior ischemic optic neuropathy (NAION), history of temporary or permanent loss of vision, including unilateral loss of vision

Annotated entities:
- Condition: "non-arteritic anterior ischemic optic neuropathy"
- Condition: "NAION"
- Condition: "loss of vision"
- Condition: "loss of vision"
- Qualifier: "temporary"
- Qualifier: "permanent"
- Qualifier: "unilateral"
- Condition: "loss of vision"
- Temporal: "history of"